Clinical trial exclusion criterion:
Chronic (longer than 14 days) administration of immunosuppressants or other immune-modifying drugs within 6 months before the first dose of investigational vaccine; oral corticosteroids in dosages of =0.5 mg/kg/d prednisolone or equivalent are excluded; inhaled or topical steroids are allowed

Annotated entities:
- Multiplier: "Chronic administration"
- Multiplier: "longer than 14 days"
- Drug: "immunosuppressants"
- Drug: "immune-modifying drugs"
- Qualifier: "other"
- Temporal: "within 6 months before the first dose of investigational vaccine"
- Reference_point: "the first dose of investigational vaccine"
- Drug: "investigational vaccine"
- Drug: "oral corticosteroids"
- Multiplier: "dosages"
- Value: "=0.5 mg/kg/d"
- Negation: "excluded"
- Qualifier: "prednisolone or equivalent"
- Non-representable: "inhaled or topical steroids are allowed"